有關成骨不全症（osteogenesis imperfecta）之敘述，下列何者錯誤？
A. 均屬於體染色體隱性（autosomal recessive）遺傳疾病
B. 大都源於第一型膠原蛋白（type I collagen）遺傳疾病
C. 最常見的臨床問題是長骨反覆骨折（recurrent fracture）
D. 多處切骨矯正及骨髓內釘固定，可降低骨折的再發

正確答案：A. 均屬於體染色體隱性（autosomal recessive）遺傳疾病